下列何種免疫調節劑是影響到適應性免疫反應（adaptive immune responses），而不同於一般細胞毒性藥物（cytotoxic agent）主要作用於所有正在分裂的細胞？
A. Azathioprine
B. Cyclophosphamide
C. Mycophenolate
D. Rapamycin

正確答案：D. Rapamycin